Which enhancers are characterized as latent?

Latent enhancers are defined as regions of the genome that in terminally differentiated cells are unbound by TFs and lack the histone marks characteristic of enhancers but acquire these features in response to stimulation.